肝臟手術中，常用pringle maneuver來控制並減少出血量，下列何結構並未包含在其中？
A. common hepatic artery
B. portal vein
C. common bile duct
D. hepatic artery proper

正確答案：A. common hepatic artery